Clinical trial exclusion criterion:
acute coronary syndrome within the 90 days prior to the scheduled procedure,

Annotated entities:
- Condition: "acute coronary syndrome"
- Temporal: "within the 90 days prior to the scheduled procedure"
- Reference_point: "the scheduled procedure"